What is a ciliopathy?

Ciliopathy is a rare disorder of the central nervous system characterized by defects in ciliary motility, endocytosis, and photoreceptors.